Clinical trial exclusion criterion:
Trastuzumab ≤ 21 days prior to randomization.

Annotated entities:
- Drug: "Trastuzumab"
- Temporal: "≤ 21 days prior to randomization"
- Reference_point: "randomization"